Clinical trial exclusion criterion:
Subjects were to have no history of known hypersensitivity or idiosyncratic reaction to the study drug or related compounds.

Entity relations:
- AND("idiosyncratic reaction", "study drug")
- AND("hypersensitivity", "study drug")
- Has_negation("hypersensitivity", "no")
- Has_negation("idiosyncratic reaction", "no")